En cromatografía, puede definirse el tiempo muerto como:
1. El tiempo transcurrido entre la inyección de una muestra y la aparición de un pico de soluto en el detector.
2. El factor que indica la cantidad de tiempo que pasa un soluto en la fase estacionaria en relación con el tiempo que pasa en la fase móvil.
3. El tiempo que una especie no retenida tarda en pasar a través de una columna cromatográfica.
4. El tiempo que tarda el analito en pasar por el detector cromatográfico.
5. La relación entre la velocidad lineal media y la longitud de empaquetamiento de la columna.

Respuesta correcta: 3. El tiempo que una especie no retenida tarda en pasar a través de una columna cromatográfica.